有關細胞週期（cell cycle）之敘述，下列何者正確？
A. 依序可分為 M 期、G1 期、G2 期、S 期，再回到 M 期
B. 可受到各種 MAP kinase（mitogen-activated protein kinase）調控
C. 被細胞外之生長因子（growth factor）所抑制
D. 只要細胞存活，細胞週期就會不斷進行

正確答案：B. 可受到各種 MAP kinase（mitogen-activated protein kinase）調控